History or other evidence of severe illness or any other conditions which would make the patient, in the opinion of the investigator, unsuitable for the study.

The above is a clinical trial exclusion criterion. Annotated with entity spans:
[Post-eligibility: History or other evidence of severe illness or any other conditions which would make the patient, in the opinion of the investigator, unsuitable for the study.]